Clinical trial exclusion criterion:
Any condition that may interfere with protocol compliance including current heavy smoking (>20 cigarettes per day or >20 pack-years with active smoking during the last 10 years), regular use of alcohol.

Entity relations:
- Has_value("cigarettes per day", ">20")
- Has_value("pack-years", ">20")
- Has_temporal("active smoking", "during the last 10 years")
- Subsumes("heavy smoking", "cigarettes per day")
- Subsumes("heavy smoking", "pack-years")
- Subsumes("heavy smoking", "active smoking")
- OR("heavy smoking", "regular use of alcohol")